Clinical trial exclusion criterion:
cT4

Annotated entities:
- Condition: "cT4"